愛滋病人受到下列何種感染時，以 Trimethoprim 與 Sulfamethoxazole 合併使用治療才有效？
A. 肺結核（Tuberculosis）
B. 隱球菌腦膜炎（Cryptococcal meningitis）
C. 口腔念珠菌病（Oral candidiasis）
D. 毒漿體原蟲病（Toxoplasmosis）

正確答案：D. 毒漿體原蟲病（Toxoplasmosis）